Clinical trial inclusion criterion:
Age greater than or equal to 18 years

Entity relations:
- Has_value("Age", "greater than or equal to 18 years")